Presence of cardiovascular comorbidities

The above is a clinical trial exclusion criterion. Annotated with entity spans:
Presence of [Condition: cardiovascular comorbidities]